Clinical trial exclusion criterion:
Prior therapy with SYK inhibitors.

Entity relations:
- AND("therapy", "SYK inhibitors")
- Has_temporal("therapy", "Prior")